Which cytokine molecule activates SMADs?

smads are activated by transforming growth factor-β (tgf-β).